關於先天性甲狀腺低能症（congenital hypothyroidism）的臨床表徵，下列那一項最為罕見？
A. 身材矮小
B. 餵食困難
C. 甲狀腺腫
D. 皮膚乾燥

正確答案：C. 甲狀腺腫